Clinical trial exclusion criterion:
Patient with left sided, colitis or pancolitis.

Annotated entities:
- Condition: "colitis"
- Condition: "pancolitis"
- Qualifier: "left sided"